Clinical trial exclusion criterion:
Pregnant women or women who are breastfeeding.

Annotated entities:
- Pregnancy_considerations: "regnant women or women who are breastfeeding"